Clinical trial exclusion criteria:
Pregnant women
Claustrophobic patient unable to undergo the examination
Breastfeeding women unwilling to temporarily stop breastfeeding
Patient with contra-indication to: dipyridamole, aminophylline, dobutamine or exercise stress test (depending on the method of cardiovascular stress test chosen)

Annotated entities:
- Condition: "Pregnant"
- Person: "women"
- Condition: "Claustrophobic"
- Negation: "unable"
- Procedure: "examination"
- Non-representable: "Breastfeeding women unwilling to temporarily stop breastfeeding"
- Condition: "contra-indication"
- Drug: "dipyridamole"
- Drug: "aminophylline"
- Drug: "dobutamine"
- Procedure: "exercise stress test"